Clinical trial inclusion criteria:
All patients admitted to the ICU in septic shock
All patients that develop septic shock while in the ICU

Annotated entities:
- Procedure: "admitted"
- Visit: "ICU"
- Condition: "septic shock"
- Condition: "septic shock"
- Temporal: "while in the ICU"
- Reference_point: "in the ICU"